Clinical trial inclusion criterion:
Capable of providing written informed consent

Annotated entities:
- Post-eligibility: "Capable of providing written informed consent"